Clinical trial inclusion criteria:
Pathologic confirmation of lung adenocarcinoma with measurable disease, defined as at least one lesion that can be accurately measured in at least one dimension (longest diameter to be recorded on CT); Patients must have previously untreated locally advanced or metastatic NSCLC; Patients must have lung cancer with a documented EGFR activating mutation (exon 19 deletion, L858R).

Annotated entities:
- Condition: "lung adenocarcinoma"
- Procedure: "Pathologic"
- Value: "confirmation"
- Qualifier: "with measurable disease"
- Multiplier: "at least one"
- Condition: "lesion"
- Qualifier: "can be accurately measured in at least one dimension"
- Qualifier: "untreated"
- Qualifier: "locally advanced"
- Qualifier: "metastatic"
- Condition: "NSCLC"
- Condition: "lung cancer"
- Qualifier: "with EGFR activating mutation"
- Condition: "exon 19 deletion"
- Condition: "L858R"
- Line: "Pathologic confirmation of lung adenocarcinoma with measurable disease, defined as at least one lesion that can be accurately measured in at least one dimension (longest diameter to be recorded on CT)"
- Line: "Patients must have previously untreated locally advanced or metastatic NSCLC"
- Line: "Patients must have lung cancer with a documented EGFR activating mutation (exon 19 deletion, L858R)."